Clinical trial exclusion criterion:
Thrombocytopenia < 50 x 10 gigalitres (Gl)

Entity relations:
- Has_value("Thrombocytopenia", "< 50 x 10 gigalitres (Gl)")